Previous enrollment in this study

The above is a clinical trial exclusion criterion. Annotated with entity spans:
[Competing_trial: Previous enrollment in this study]